Las proteínas bacterianas o virales capaces de unirse a una molécula MHC (complejo principal de histocompatibilidad) de clase II en la superficie de una célula presentadora (sin ser endocitadas ni procesadas por ella), y al dominio variable de una cadena beta del receptor de células T, para activar células T, se denominan:
1. Antígenos timo-independientes.
2. Antígenos timo-dependientes.
3. Superantígenos.
4. Mitógenos.

Respuesta correcta: 3. Superantígenos.